Which phosphatase is inhibited by LB-100?

LB-100 is a phosphatase 2A inhibitor